Clinical trial inclusion criterion:
Male subjects with female partners of child-bearing potential must agree to use one of the contraception methods listed in Protocol. This criterion must be followed from the time of the first dose of study medication until the follow-up contact visit.

Annotated entities:
- Context_Error: "Male subjects with female partners of child-bearing potential must agree to use one of the contraception methods listed in Protocol."
- Post-eligibility: "Male subjects with female partners of child-bearing potential must agree to use one of the contraception methods listed in Protocol."
- Parsing_Error: "This criterion must be followed from the time of the first dose of study medication until the follow-up contact visit."
- Post-eligibility: "This criterion must be followed from the time of the first dose of study medication until the follow-up contact visit."